下列關於細胞黏著分子（adhesion molecule）的敘述，何者錯誤？
A. 內皮細胞上的黏著分子包括 E-selectin、P-selectin 和 L-selectin，屬於免疫球蛋白家族成員
B. 整合凝集素（integrin）屬於黏著分子，由兩條非共價鍵結合的蛋白鏈組成
C. 選擇凝集素（selectin）與糖類分子結合
D. 細胞激素（cytokine）會誘發黏著分子在內皮細胞上表現

正確答案：A. 內皮細胞上的黏著分子包括 E-selectin、P-selectin 和 L-selectin，屬於免疫球蛋白家族成員